下列何種骨盆腔脫垂，在病理生理及解剖構造上較符合疝氣（hernia）的定義？
A. 尿道膨出（urethrocele）
B. 膀胱膨出（cystocele）
C. 小腸膨出（enterocele）
D. 直腸膨出（rectocele）

正確答案：C. 小腸膨出（enterocele）